Clinical trial inclusion criterion:
DSM-IV or DSM-5 diagnosis of schizophrenia or schizoaffective disorder

Entity relations:
- Has_qualifier("schizophrenia", "DSM-IV")
- OR("DSM-IV", "DSM-5")
- OR("schizophrenia", "schizoaffective disorder")